¿Cuál es el factor pronóstico más importante en el Melanoma Estadio 1?
1. Nivel sérico de LDH.
2. Espesor tumoral medido en el índice de Breslow.
3. La presencia de ulceración clínica o histológica.
4. Número de metástasis.
5. El índice mitótico. El índice mitótico.

Respuesta correcta: 2. Espesor tumoral medido en el índice de Breslow.